Clinical trial exclusion criterion:
age <18y

Entity relations:
- Has_value("age", "<18y")